What is resistin?

The adipocyte-secreting adipokine, resistin, may play a critical role in the modulation of inflammatory diseases.